若睪丸腫瘤顯微鏡檢，發現大量出血壞死及cytotrophoblastic cells，另外血中β-HCG異常升高，下列診斷何者最適當？
A. choriocarcinoma
B. yolk sac tumor
C. embryonal carcinoma
D. spermatocytic seminoma

正確答案：A. choriocarcinoma